Clinical trial inclusion criterion:
Clinically significant apathy for at least four weeks for which either 1) the frequency of apathy as assessed by the Neuropsychiatric Inventory (NPI) is 'Very frequently', or 2) the frequency of apathy as assessed by the NPI is 'Frequently' or 'Often' AND the severity of apathy as assessed by the NPI is 'Moderate' or 'Marked'

Entity relations:
- Has_value("Neuropsychiatric Inventory (NPI)", "Very frequently")
- AND("frequency of apathy", "NPI")
- Has_value("NPI", "Moderate")
- Has_value("NPI", "Frequently")
- AND("severity of apathy", "NPI")
- AND("frequency of apathy", "Neuropsychiatric Inventory (NPI)")
- OR("Frequently", "Often")
- OR("Moderate", "Marked")
- OR("frequency of apathy", "severity of apathy")